下列何者不包括在1986年渥太華健康促進宣言的健康促進五大行動綱領？
A. 健康政策
B. 健康環境
C. 社區的參與
D. 媒體宣導

正確答案：D. 媒體宣導